Use of Belviq XR within 6 months before Screening or hypersensitivity to Belviq XR or any of the excipients

The above is a clinical trial exclusion criterion. Annotated with entity spans:
Use of [Drug: Belviq XR] [Temporal: within 6 months before Screening] or [Condition: hypersensitivity] to [Drug: Belviq XR] [Qualifier: or any of the excipients]